內視鏡經常透過下列何者來檢視卵巢狀況？
A. 子宮
B. 膀胱
C. 直腸
D. 陰道穹窿

正確答案：D. 陰道穹窿